Clinical trial inclusion criterion:
=3 episodes of VT treated with antitachycardia pacing (ATP), at least one of which was symptomatic

Annotated entities:
- Multiplier: "3 episodes"
- Condition: "VT"
- Procedure: "antitachycardia pacing"
- Procedure: "ATP"
- Multiplier: "at least one"
- Qualifier: "symptomatic"